下列有關頸椎的敘述，何者錯誤？
A. 椎動脈（vertebral artery）不穿過第七頸椎的橫突孔
B. 第一頸椎沒有棘突與椎體
C. 第二頸椎的齒突（dens）源自第一頸椎的椎體
D. 第七頸椎棘突末端呈明顯的分枝

正確答案：D. 第七頸椎棘突末端呈明顯的分枝